Clinically significant (> 4 Tablespoons per day) sputum production

The above is a clinical trial exclusion criterion. Annotated with entity spans:
[Qualifier: Clinically significant] ([Multiplier: > 4 Tablespoons per day]) [Observation: sputum production]